一位60歲的女性，有嚴重的下背痛且行走困難。脊椎X光檢查顯示第四、五腰椎椎莖（pedicle）完整、椎間盤空隙變窄 （disc space narrowing）、椎體終板破壞（endplate erosion）。依照X光結果判斷，下列何者是最適當的診斷？
A. 惡性腫瘤轉移
B. 椎間盤退化性病變
C. 脊椎感染
D. 脊椎滑脫症

正確答案：C. 脊椎感染